Clinical trial exclusion criterion:
Known active brain metastases

Annotated entities:
- Qualifier: "active"
- Condition: "brain metastases"
- Temporal: "active"